Clinical trial exclusion criterion:
Use of any other endoscopic method to stop GI bleeding beyond endoscopic band ligation

Entity relations:
- Has_negation("endoscopic band ligation", "any other")
- AND("endoscopic method", "endoscopic band ligation")
- AND("endoscopic method", "GI bleeding")